某國小爆發數十名學童先後在5 日內發生下痢的事件，症狀包含腹瀉、發燒、嘔吐、裏急後重（tenesmus）。由其中十多名患者的糞便中及該校師生用來洗手的地下水中，分離出一株不發酵乳糖、無運動性之腸內桿菌科（Enterobacteriaceae）細菌。衛生單位對患者施以居家隔離，消毒地下水，並對全校師生投予抗生素後，疫情幸未再擴大。下列菌屬中，何者最有可能是造成此次事件的元兇？
A. 埃希氏菌屬（Escherichia）
B. 沙門氏菌屬（Salmonella）
C. 志賀氏菌屬（Shigella）
D. 耶爾辛氏菌屬（Yersinia）

正確答案：C. 志賀氏菌屬（Shigella）